sign the informed consent form

The above is a clinical trial inclusion criterion. Annotated with entity spans:
[Informed_consent: sign the informed consent form]